Clinical trial exclusion criterion:
regnant women

Annotated entities:
- Condition: "regnant"
- Person: "women"